Which method for subsampling of NGS reads requires only gene counts?

The subSeq R package, which uses a novel efficient approach to perform this subsampling and to calculate informative metrics at each depth